Clinical trial inclusion criterion:
Inability to take aspirin at a dosage of 100 mg or less

Entity relations:
- Has_multiplier("aspirin", "100 mg or less")
- AND("Inability to take", "aspirin")